細胞壞死時，pyknosis 之變化為：
A. 核變小，染色質鬆散
B. 核變小，染色質凝聚
C. 核變大，染色質鬆散
D. 核變大，染色質凝聚

正確答案：B. 核變小，染色質凝聚